contra-indications of radiotherapy

The above is a clinical trial exclusion criterion. Annotated with entity spans:
[Condition: contra-indications] of [Procedure: radiotherapy]